Clinical trial exclusion criterion:
severe hepatic insufficiency or paracetamol (acetaminophen) is contraindicated for other reason

Annotated entities:
- Qualifier: "severe"
- Condition: "hepatic insufficiency"
- Drug: "paracetamol"
- Drug: "acetaminophen"
- Condition: "contraindicated"